Un hombre de 80 años es ingresado por un cuadro brusco de afasia y hemiparesia derecha. Como antecedentes destaca, hipertensión, bien controlada con dieta y deterioro cognitivo en el último año en estudio por su neurólogo. La TC craneal de urgencias demuestra un hematoma lobar frontal izquierdo sin captación de contraste. ¿Cuál es la causa más probable del hematoma?
1. Malformación arteriovenosa enmascarada por el hematoma agudo.
2. Hipertensión arterial crónica.
3. Vasculitis aislada del sistema nervioso.
4. Tumor cerebral.
5. Angiopatía cerebral amiloidea (angiopatía congofílica).

Respuesta correcta: 5. Angiopatía cerebral amiloidea (angiopatía congofílica).